Having a regular menstrual cycle of which the menstrual period is between day 3-7, and the period between day 25-35;

The above is a clinical trial inclusion criterion. Annotated with entity spans:
Having a [Condition: regular menstrual cycle] of which the [Measurement: menstrual period] is [Value: between day 3-7], [Grammar_Error: and] the period [Value: between day 25-35];